What is MINDY (motif interacting with Ub-containing novel DUB family)?

MINDY-1 is a member of an evolutionarily conserved and structurally distinct new family of deubiquitinating enzymes.